Clinical trial exclusion criterion:
contraindication to regional anaesthesia (coagulopathies, concurrent anticoagulant therapy, allergy to local anaesthetics, infection at puncture site)

Annotated entities:
- Condition: "contraindication"
- Procedure: "regional anaesthesia ("
- Condition: "coagulopathies"
- Drug: "anticoagulant therapy"
- Condition: "allergy"
- Procedure: "local anaesthetics"
- Condition: "infection"
- Qualifier: "puncture site"